由中腦 ventral tegmental area 投射至 nucleus accumbens 之路徑在 reward system 中扮演重要角色，此路徑之重要神經傳遞物質（neurotransmitter）為何？
A. GABA
B. dopamine
C. glutamate
D. glycine

正確答案：B. dopamine